下列那幾項敘述是正確的？①上腹痛原因不包括急性膽囊炎 ②急性大腸憩室炎的壓痛點為McBurney point  ③急性胰臟炎容易輻射痛至右側肩膀 ④脾臟膿瘍容易輻射痛至左側肩膀 ⑤腹主動脈瘤剝離之疼痛可能傳導至肩膀區域
A. ①②
B. ③④
C. ④⑤
D. ①④

正確答案：C. ④⑤